志玲每次戴了含鎳的項鍊或耳環表演後幾天就會在接觸的地方產生癢疹。皮膚科醫師認為是免疫反應產生的過敏性皮膚炎。這些認識含鎳抗原的免疫細胞是在何處產生敏感化（sensitization），在何處執行其免疫功能（effector function）？
A. 敏感化：皮膚，執行功能：淋巴結
B. 敏感化：淋巴結，執行功能：皮膚
C. 敏感化和執行功能都在皮膚
D. 敏感化和執行功能都在淋巴結

正確答案：B. 敏感化：淋巴結，執行功能：皮膚